供應鼻部血管中，那一條血管不是由外頸動脈供應？
A. 前篩動脈（anterior ethmoidal artery）
B. 上唇動脈（superior labial artery）
C. 大腭動脈（greater palatine artery）
D. 蝶腭動脈（sphenopalatine artery）

正確答案：A. 前篩動脈（anterior ethmoidal artery）